5. Can understand the study procedures and can sign an informed consent form.

The above is a clinical trial inclusion criterion. Annotated with entity spans:
5. [Non-query-able: Can understand the study procedures and can sign an informed consent form].